Clinical trial exclusion criterion:
Pregnancy or in breast-feeding

Annotated entities:
- Pregnancy_considerations: "Pregnancy or in breast-feeding"